Clinical trial exclusion criterion:
ongoing trauma (e.g. current involvement in an abusive relationship).

Entity relations:
- Has_temporal("trauma", "ongoing")
- Has_temporal("involvement in an abusive relationship", "current")
- Subsumes("trauma", "involvement in an abusive relationship")